Clinical trial exclusion criterion:
Exposure to sun or UV radiations, 15 days before the patch testing.

Entity relations:
- Has_temporal("Exposure to sun", "15 days before the patch testing")
- Has_index("15 days before the patch testing", "the patch testing")
- OR("Exposure to sun", "Exposure to UV radiations")